Clinical trial inclusion criterion:
Not pregnant at the time of enrollment

Entity relations:
- Has_negation("pregnant", "Not")
- Has_temporal("pregnant", "at the time of enrollment")